Clinical trial exclusion criterion:
Active implantable medical device (i.e. DBS, spinal cord stimulator, pacemaker, defibrillator, vagus nerve stimulator, programmable shunt).

Entity relations:
- Subsumes("implantable medical device", "DBS")
- Has_qualifier("implantable medical device", "Active")
- OR("DBS", "spinal cord stimulator", "pacemaker", "defibrillator", "vagus nerve stimulator", "programmable shunt")